Subject has significant peripheral neuropathy, patient defined as a patient with Type I or Type II diabetes or similar systemic metabolic condition causing decreased sensation in a stocking-like or non-radicular and non-dermatomal distribution in the lower extremities.

The above is a clinical trial exclusion criterion. Annotated with entity spans:
Subject has [Qualifier: significant] [Condition: peripheral neuropathy], patient defined as a patient with [Qualifier: Type I] or [Qualifier: Type II] [Condition: diabetes] or [Qualifier: similar] [Condition: systemic metabolic condition] causing [Condition: decreased sensation] in a [Qualifier: stocking-like] or [Qualifier: non-radicular] and [Qualifier: non-dermatomal distribution] in the [Qualifier: lower extremities].